下列那一種方法無法確定是否排卵？
A. 基礎體溫
B. 血液黃體素
C. 超音波
D. 血液雌激素

正確答案：D. 血液雌激素